下列治療 congestive heart failure 藥物中，何者降低 preload 作用最明顯？
A. Furosemide
B. Dobutamine
C. Digoxin
D. Captopril

正確答案：A. Furosemide